65歲男性病人因嚴重肺炎合併呼吸衰竭，入住加護病房，經投予廣效抗生素三天後退燒；但在第五天出現腹痛，腹脹及水便 （每日至少五次），下列敘述何者最為適當？
A. 糞便中Clostridium difficile toxin毒素檢測陰性，可排除Clostridium difficile相關腹瀉之診斷
B. 糞便培養長出Clostridium difficile，可確診Clostridium difficile相關腹瀉之診斷
C. 如腹瀉症狀明顯，可先使用loperamide來緩和症狀
D. 可用口服metronidazole治療

正確答案：D. 可用口服metronidazole治療